Clinical trial exclusion criterion:
Patients with a history of coronary artery disease, valvular or hypertensive heart disease

Annotated entities:
- Temporal: "history"
- Condition: "coronary artery disease"
- Condition: "hypertensive heart disease"
- Condition: "heart disease valvular"